Clinical trial exclusion criteria:
Contraindication to azithromycin use and other prophylactic antibiotic use

Annotated entities:
- Condition: "Contraindication"
- Drug: "azithromycin"
- Qualifier: "other"
- Drug: "prophylactic antibiotic use"